No other surgical contraindications.

The above is a clinical trial inclusion criterion. Annotated with entity spans:
[Negation: No] [Observation: other surgical contraindications].